All patients within adult ICUs are included, including rare patients <18 years and >=12 years.

The above is a clinical trial inclusion criterion. Annotated with entity spans:
All patients within [Visit: adult ICUs] are included, including [Person: rare patients] [Value: <18 years and >=12 years].